2. Subjects with platinum-refractory disease, defined as disease progression while receiving first line platinum-based therapy.

The above is a clinical trial exclusion criterion. Annotated with entity spans:
[Parsing_Error: 2.] Subjects with [Condition: platinum-refractory disease], defined as [Condition: disease progression] [Temporal: while receiving first line platinum-based therapy].